Clinical trial exclusion criterion:
2. advanced labor

Annotated entities:
- Condition: "advanced labor"